Clinical trial exclusion criterion:
Major surgery, biopsy of a parenchymal organ, or significant trauma within the past 2 months (this includes any trauma associated with the current myocardial infarction)

Annotated entities:
- Procedure: "Major surgery"
- Procedure: "biopsy"
- Qualifier: "parenchymal organ"
- Condition: "trauma"
- Qualifier: "significant"
- Temporal: "past 2 months"
- Condition: "myocardial infarction"